一位 3 歲男童發燒 5 天，有嚴重咳嗽，眼睛發紅，臉部與軀幹部有米粒至豌豆大小斑丘疹，並無水泡，頸部淋巴腺腫大。上述描述中那一項是麻疹的特徵，而且較少見於川崎氏病（Kawasaki's disease）？
A. 咳嗽
B. 皮疹大小形狀
C. 眼睛發紅
D. 頸部淋巴腺腫大

正確答案：A. 咳嗽